Clinical trial exclusion criterion:
Women did not have breast cancer

Entity relations:
- Has_negation("breast cancer", "not")